Clinical trial inclusion criterion:
COPD diagnosed according to GOLD, FEV1 40-80% predicted, SpO2 =92% at 750 m.

Entity relations:
- Has_value("FEV1", "40-80% predicted")
- Has_qualifier("SpO2", "750 m")
- Has_value("SpO2", "=92%")
- Has_qualifier("COPD", "GOLD")